Patients who are being prepared for surgery, or during or after surgery.

The above is a clinical trial exclusion criterion. Annotated with entity spans:
Patients who are [Mood: being prepared for] [Procedure: surgery], or [Temporal: during] or [Temporal: after surgery].